Diabetes Mellitus (DM)

The above is a clinical trial exclusion criterion. Annotated with entity spans:
[Condition: Diabetes Mellitus (DM)]